Clinical trial exclusion criterion:
History of motion sickness or PONV

Annotated entities:
- Temporal: "History"
- Condition: "motion sickness"
- Condition: "PONV"